What are TAMs in cancer therapy?

TAMs are Tumor Associated Macrophages and are important in Cancer therapy.